Clinical trial inclusion criterion:
Unexplained infertility.

Annotated entities:
- Qualifier: "Unexplained"
- Condition: "infertility"